正常情況下，深呼吸不會導致下列何項生理反應？
A. 大幅增加動脈血液總含氧量（oxygen content）
B. 刺激表面活性劑（surfactant）的分泌
C. 增加肺泡通氣量（alveolar ventilation）
D. 增加肺順應性（lung compliance）

正確答案：A. 大幅增加動脈血液總含氧量（oxygen content）